聽覺傳導路徑（auditory pathway）之敘述，下列何者錯誤？
A. 初級聽覺皮質（primary auditory cortex）位於顳葉（temporal lobe）
B. 上橄欖核（superior olivary nucleus）參與聽覺之傳導
C. 右邊內耳之聽覺訊息可傳入左右兩邊之內側膝狀體（medial geniculate body）
D. 左邊內側膝狀體（medial geniculate body）之聽覺訊息，可傳入左右兩邊之初級聽覺皮質（primary

正確答案：D. 左邊內側膝狀體（medial geniculate body）之聽覺訊息，可傳入左右兩邊之初級聽覺皮質（primary